Clinical trial exclusion criterion:
History of seizure disorder

Entity relations:
- Has_temporal("seizure disorder", "History")